La calidad que se establece en la medida en que los pacientes experimentan una curación o mejoría en su proceso de salud y que es clínicamente comprobable recibe el nombre de “calidad”:
1. Directa.
2. Indirecta.
3. Cruzada.
4. Percibida.
5. Demostrada.

Respuesta correcta: 1. Directa.